Clinical trial inclusion criterion:
Confirmed idiopathic pulmonary hypertension, connective tissue disease associated pulmonary hypertension, congenital heart disease(with Eisenmenger syndrome) associated pulmonary hypertension.

Entity relations:
- AND("congenital heart disease", "Eisenmenger syndrome")
- causal("pulmonary hypertension", "congenital heart disease")
- Has_qualifier("pulmonary hypertension", "connective tissue disease associated")
- OR("idiopathic pulmonary hypertension", "pulmonary hypertension", "pulmonary hypertension")